Clinical trial inclusion criterion:
4. self-reported failure of eccentric exercise protocol (at least 75% completion)

Annotated entities:
- Condition: "failure of eccentric exercise protocol"
- Value: "at least 75%"
- Observation: "self-reported"